Unable to consent

The above is a clinical trial exclusion criterion. Annotated with entity spans:
[Non-query-able: Unable to consent]